Ladybird homeobox (Lbx) transcription factors regulate the development of what body systems/organs?

Ladybird homeobox (Lbx) transcription factors have crucial functions in muscle and nervous system development in many animals.